Are ineligible to take the antiarrhythmic drug to which they would be assigned due to allergy, intolerance or contraindication

The above is a clinical trial exclusion criterion. Annotated with entity spans:
Are ineligible to take the [Drug: antiarrhythmic drug] to which they would be assigned due to [Condition: allergy], [Condition: intolerance] or [Condition: contraindication]